Si en una prueba diagnóstica se observan un 3% de falsos positivos, se puede afirmar que:
1. La sensibilidad es del 97%.
2. La especificidad es del 97%.
3. El valor predictivo positivo es del 97%.
4. La especificidad es del 3%.
5. La sensibilidad es del 3%.

Respuesta correcta: 2. La especificidad es del 97%.